El aceite de oliva tiene en su composición los siguientes nutrientes, EXCEPTO:
1. Colesterol.
2. Ácido oleico.
3. Antioxidantes.
4. Vitamina E.
5. Ácido linoleico.

Respuesta correcta: 1. Colesterol.